Subjects with ectatic eye disorders.

The above is a clinical trial exclusion criterion. Annotated with entity spans:
Subjects with [Condition: ectatic eye disorders].